一位 38 歲男性跟朋友聚餐後騎機車與酒駕之轎車對撞，跌落排水溝中，造成全身多處外傷及骨折。經送往急診室，初步檢查生命跡象穩定，意識清楚，右小腿骨折處有一個 10 公分長的傷口，可以看到骨折的斷端。X 光檢查顯示右小腿中段脛骨及腓骨開放性骨折，右側股骨關節脫臼以及右側肱骨骨折。對其骨折及脫臼的各種處置，下列何者為最正確之敘述？
A. 對於右小腿開放性骨折，為避免骨折位置失血過多，應儘速清洗傷口後，將傷口緊密縫合，一方面可以減少繼續流血，一方面可避免傷口感染的機會
B. 對於右小腿開放性骨折，為避免多次手術破壞周圍軟組織，應於手術時採用堅固的內固定，如鋼釘、鋼板固定骨折
C. 股骨關節脫位大部分都是往前脫位（anterior dislocation），應儘速於 6 至 8 小時內將其復位，以減少併發症及後遺症
D. 右上肢肱骨骨折之手術固定若採開放式復位（open reduction），經常容易造成垂腕（drop wrist），主要是因為橈神經（radial nerve）受損所致

正確答案：D. 右上肢肱骨骨折之手術固定若採開放式復位（open reduction），經常容易造成垂腕（drop wrist），主要是因為橈神經（radial nerve）受損所致